Impaired renal function (Serum creatinine >1.5 mg/dL in male, >1.4 mg/dL in female )

The above is a clinical trial exclusion criterion. Annotated with entity spans:
[Condition: Impaired renal function] ([Measurement: Serum creatinine] [Value: >1.5 mg/dL] in [Person: male], [Value: >1.4 mg/dL] in [Person: female] )